Clinical trial exclusion criterion:
History of alcoholism, drug abuse, psychiatric, psychological or other emotional problems that are likely to invalidate informed consent

Entity relations:
- OR("psychiatric problems", "psychological problems", "emotional problems")